List five proteins with antioxidant properties?

thioredoxin 1 (Trx1), 
peroxiredoxin 1 (Prx1), 
GSH reductase (GSR),
phosphatase and tensin homolog (PTEN)
superoxide dismutase (SOD)